正常年輕男性呈上身直立姿勢時，肺動脈瓣之前體表投影位最接近下列何處？
A. 左側第三肋間
B. 左側第五肋間
C. 右側第四肋間
D. 右側第六肋間

正確答案：A. 左側第三肋間